Clinical trial exclusion criterion:
With a bleeding condition or on anti-coagulant therapy

Annotated entities:
- Condition: "bleeding condition"
- Procedure: "anti-coagulant therapy"